12歲小婷罹患第一型糖尿病已有2年，這期間她因為暴瘦、多尿、喘息及脫水進出醫院加護病房已有7次，醫師懷疑她沒有遵循治療計畫，沒有施打胰島素。雖然經多方輔導及說服，她仍堅不配合，家屬也一副事不關己的態度，認為一切問題往醫院送就會得到解決。現在，她又很危急地被送到急診室來，下列何種處置最合適？
A. 通報社會局等相關主管單位
B. 可以直接判定小婷沒有醫療決策能力
C. 加入心理諮商或精神醫療之專業輔導治療
D. 延長病童住院時間直到解決拒絕治療之問題

正確答案：C. 加入心理諮商或精神醫療之專業輔導治療